Clinical trial exclusion criterion:
Daily narcotic or opiate use for greater than the 2 months prior to enrollment in the study.

Annotated entities:
- Drug: "narcotic"
- Multiplier: "Daily"
- Drug: "opiate"
- Temporal: "for greater than the 2 months prior to enrollment in the study"
- Reference_point: "enrollment in the study"